triptans

The above is a clinical trial exclusion criterion. Annotated with entity spans:
[Drug: triptans]